15. History of malignancy within the last 5 years, except nonmelanoma skin cancer and cervical carcinoma in situ treated with curative intent.

The above is a clinical trial exclusion criterion. Annotated with entity spans:
[Parsing_Error: 15.] [Temporal: History] of [Condition: malignancy] [Temporal: within the last 5 years], [Negation: except] [Condition: nonmelanoma skin cancer] and [Condition: cervical carcinoma in situ] [Procedure: treated] with [Qualifier: curative intent].